Clinical trial exclusion criterion:
Women who are pregnant or breastfeeding, as well as those of reproductive potential unless there is a negative urine pregnancy test on the day of surgery;

Annotated entities:
- Pregnancy_considerations: "Women who are pregnant or breastfeeding, as well as those of reproductive potential unless there is a negative urine pregnancy test on the day of surgery"